一位30歲女性懷孕三個月，體檢發現其甲狀腺輕微腫大觸感堅實。	血發現free T4 0.6 ng/dL（normal range 0.8～1.8  ng/dL），T3 120 ng/dL（normal range 80～180 ng/dL），TSH 20µIU/mL（normal range 0.1～2.0 µIU/mL），你認為她的甲狀腺功能如何？
A. 正常甲狀腺功能（euthyroidism）
B. 甲狀腺功能亢進（hyperthyroidism）
C. 次發性甲狀腺功能低下（secondary hypothyroidism）
D. 原發性甲狀腺功能低下（primary hypothyroidism）

正確答案：D. 原發性甲狀腺功能低下（primary hypothyroidism）